Clinical trial exclusion criterion:
patients with an absolute indication for administration of antibiotics at the moment of ICU admission (meningitis, pneumonia) or a chronic infection for which long-term antibiotic treatment is necessary (endocarditis, osteo-articular infections, mediastinitis, deep abscesses, pneumocystis infection, toxoplasmosis, tuberculosis)

Entity relations:
- AND("indication", "antibiotics")
- Subsumes("indication", "meningitis")
- Has_qualifier("antibiotic treatment", "long-term")
- AND("antibiotic treatment", "chronic infection")
- Subsumes("chronic infection", "endocarditis")
- Subsumes("chronic infection", "osteo-articular infections")
- Subsumes("chronic infection", "mediastinitis")
- Subsumes("chronic infection", "deep abscesses")
- Subsumes("chronic infection", "pneumocystis infection")
- Subsumes("chronic infection", "toxoplasmosis")
- Subsumes("chronic infection", "tuberculosis")
- OR("meningitis", "pneumonia")